80歲女性，有高血壓與心房顫動病史，突發左側顏面與左側肢體無力，左上肢肌力為1分，左下肢肌力為3分，兩眼偏向右看，無明顯的視野缺損與忽略。病灶最可能在何處？
A. 右大腦額葉（frontal lobe）
B. 右大腦頂葉（parietal lobe）
C. 右內囊與被殼（internal capsule and putamen）
D. 右橋腦（pons）

正確答案：A. 右大腦額葉（frontal lobe）